下列何者最有助於增進對於刺激部位（localization of a stimulus site）辨識的精準度？
A. descending regulation pathway
B. lateral inhibition
C. rapid adaptation
D. slow adaptation

正確答案：B. lateral inhibition